What is Aortitis?

Aortitis is the inflammation of the aorta due to various causes. Aortitis is classified as non-infectious or infectious.